En una distribución normal:
1. La Media de las puntuaciones es cero.
2. La Desviación Típica es igual a la unidad.
3. La Media es igual a la Mediana.
4. La Media no tiene por qué coincidir con la Mediana.
5. No se puede calcular la Moda.

Respuesta correcta: 3. La Media es igual a la Mediana.